En el trastorno obsesivo-compulsivo el objetivo de los comportamientos o actos mentales es prevenir o disminuir:
1. La ansiedad o el malestar, o evitar algún suceso o situación temida.
2. El estado de alerta o el estado de malestar sobre su cuerpo e imagen.
3. La preocupación obsesiva por su mundo interior o por su imagen corporal.
4. El malestar clínicamente significativo relacionado con su mundo laboral.

Respuesta correcta: 1. La ansiedad o el malestar, o evitar algún suceso o situación temida.